Clinical trial inclusion criterion:
GOLD 2: 0.50=FEV1<0.80 and FEV1/FVC < 0.70

Entity relations:
- Has_value("GOLD", "2")
- Has_value("FEV1", "0.50= <0.80")
- Has_value("FEV1/FVC", "< 0.70")
- Subsumes("GOLD", "FEV1")